下列何者無助於改善貧血？
A. 口服 ferrous fumarate
B. 注射 iron dextran
C. 注射 deferoxamine
D. 補充維生素B12及葉酸（folic acid）

正確答案：C. 注射 deferoxamine